use more than 2g a day; 5 times a week to everyday

The above is a clinical trial exclusion criterion. Annotated with entity spans:
use [Multiplier: more than 2g a day]; [Multiplier: 5 times a week to everyday]